proven acute deep venous thrombosis, less than 21 days and who were referred to the interventional radiology department.

The above is a clinical trial inclusion criterion. Annotated with entity spans:
[Qualifier: proven] [Qualifier: acute] [Condition: deep venous thrombosis], [Multiplier: less than 21 days] and who were [Mood: referred to] the [Visit: interventional radiology department].